Clinical trial inclusion criterion:
Undergoing right upper extremity surgery with supraclavicular block as the primary anesthetic

Annotated entities:
- Temporal: "Undergoing"
- Procedure: "right upper extremity surgery"
- Procedure: "supraclavicular block"
- Qualifier: "primary anesthetic"